下列那一項為病例對照研究的主要缺點？
A. 生態謬誤
B. 回憶偏差
C. 診斷標準改變
D. 不適合研究稀有疾病

正確答案：B. 回憶偏差